Willing to strictly follow the study protocol;

The above is a clinical trial inclusion criterion. Annotated with entity spans:
[Non-query-able: Willing to strictly follow the study protocol;]